Clinical trial exclusion criterion:
Contraindications to placement of a Foley catheter in the bladder.

Annotated entities:
- Condition: "Contraindications"
- Procedure: "placement of a Foley catheter"
- Qualifier: "bladder"